胚胎發育時，十二指腸向右旋轉，導致腹胰芽也向背側移動而逐漸形成胰臟之何部分？
A. 頭部
B. 鈎狀部和頭部下段
C. 尾部
D. 體部

正確答案：B. 鈎狀部和頭部下段